Clinical trial exclusion criteria:
Lack of consent

Annotated entities:
- Post-eligibility: "Lack of consent"